Clinical trial exclusion criterion:
Allergy to NAC

Annotated entities:
- Condition: "Allergy"
- Drug: "NAC"